陳女士今年 55 歲患有糖尿病 15 年之久。近半年來陳女士常有視力模糊、下肢水腫及尿中泡沫增多等症狀。她在眼科檢查得知有糖尿病視網膜病變（diabetic retinopathy）。之後被轉介到腎臟科門診，一系列檢查結果如下：血漿：BUN 42 mg/dL, Creatinine 3.0 mg/dL, Na+ 145 mEq/L, K+ 5.3 mEq/L, Albumin 3.0 g/dL, Cholesterol 350 mg/dL, Triglyceride 400 mg/dL。24 小時尿液檢查：Volume 1000 mL; Protein 450 mg/dL, Creatinine 120 mg/dL, Na+ 44 mEq/L。因此陳女士計算的肌酸酐廓清率對其真正 glomerular filtration rate（GFR）會：
A. 高估，因肌酸酐可自腎小管分泌至尿液
B. 低估，因肌酸酐可自腎小管重吸收
C. 不變，因肌酸酐自腎小管重吸收及分泌
D. 不變，因肌酸酐不會自腎小管重吸收及分泌

正確答案：A. 高估，因肌酸酐可自腎小管分泌至尿液